Drug/alcohol abuse, psychological or spiritual illness that may interfere compliance to the study

The above is a clinical trial exclusion criterion. Annotated with entity spans:
[Intoxication_considerations: Drug/alcohol abuse, psychological or spiritual illness that may interfere compliance to the study]